Target lesion length =150 mm by angiographic estimation

The above is a clinical trial inclusion criterion. Annotated with entity spans:
[Condition: Target lesion] [Measurement: length] [Value: =150 mm] by [Procedure: angiographic] estimation